Provision of fully informed consent prior to study specific procedures.

The above is a clinical trial inclusion criterion. Annotated with entity spans:
[Informed_consent: Provision of fully informed consent prior to study specific procedures].